Clinical trial exclusion criterion:
Pregnancy and breast feeding

Annotated entities:
- Pregnancy_considerations: "Pregnancy and breast feeding"